Clinical trial inclusion criterion:
ASA physical status I-II

Entity relations:
- Has_value("ASA physical status", "I-II")